any history of stroke, transient ischemic attack (TIA), instable angina pectoris or myocardial infarction within last 3 months prior to baseline visit

The above is a clinical trial exclusion criterion. Annotated with entity spans:
any history of [Condition: stroke], [Condition: transient ischemic attack] ([Condition: TIA]), [Qualifier: instable] [Condition: angina pectoris] or [Condition: myocardial infarction] within [Temporal: last 3 months prior to baseline visit]